Clinical trial exclusion criterion:
End stage liver disease, defined as acute or chronic liver disease and recent history of one of the following: ascites, encephalopathy, variceal bleeding, bilirubin equal or greater than 2.0 mg/dL, albumin equal or less than 3.5 g/ dL, prothrombin time greater or equal to 4 seconds, INR greater than or equal to 1.7 or prior liver transplant

Entity relations:
- Has_value("bilirubin", "equal or greater than 2.0 mg/dL")
- Has_value("albumin", "equal or less than 3.5 g/ dL")
- Has_value("prothrombin time", "greater or equal to 4 seconds")
- Has_value("INR", "greater than or equal to 1.7")
- Has_temporal("liver transplant", "prior")
- Has_temporal("ascites", "recent")
- Subsumes("End stage liver disease", "acute liver disease")
- OR("acute liver disease", "chronic liver disease")
- OR("ascites", "prothrombin time", "liver transplant", "albumin", "bilirubin", "variceal bleeding", "encephalopathy", "INR")